Patients with fluid restriction or who are unable to drink up to 900 ml of fluid within 10 minutes prior to the VCE

The above is a clinical trial exclusion criterion. Annotated with entity spans:
Patients with [Observation: fluid restriction] or who are [Observation: unable to drink] up to 900 ml of fluid within 10 minutes [Temporal: prior to the VCE]